Clinical trial exclusion criterion:
Patients who experienced organ failure by acute exacerbation of liver cirrhosis within the past 1 month

Entity relations:
- AND("organ failure", "acute exacerbation of liver cirrhosis")
- Has_temporal("acute exacerbation of liver cirrhosis", "past 1 month")